El porcentaje aproximado del genoma humano que codifica proteínas es un:
1. 25%.
2. 10%.
3. 2%
4. 6%.
5. 8%.

Respuesta correcta: 3. 2%